Clinical trial exclusion criteria:
Adults older than 45 and children younger than 18 years
Platelet count higher than 30x109/l at time of screening
Suspicion of secondary ITP
Positive family history for ITP
Presence or history of autoimmune disease as judged by the investigator
Hepatosplenomegaly
Presence or history of relevant hepatic disease as judged by the investigator
Presence or history of thromboembolic disease as judged by the investigator
Patients with splenectomy
Women who are pregnant or breast feeding
Intention to become pregnant during the course of the study
Lack of safe double contraception (see 7.1)
Any vaccination 2 weeks prior start of the study
Drugs with a known impact on the immune system or on platelet function must be recorded and an exclusion of the study should be discussed with the study center
Known or suspected non-compliance, drug or alcohol abuse
Inability to follow the procedures of the study, e.g. due to language problems, psychological disorders, dementia of the study subject
Participation in another study with investigational drug within the 30 days preceding and during the present study
Previous enrolment into the current study
Previous treatment with romiplostim or eltrombopag
Hypersensitivity to the active substance or to any of the excipients or to E. coli derived proteins
Enrolment of the investigator, his/her family members, employees and other dependent persons

Annotated entities:
- Person: "Adults"
- Value: "older than 45"
- Person: "children"
- Value: "younger than 18 years"
- Measurement: "Platelet count"
- Value: "higher than 30x109/l"
- Temporal: "at time of screening"
- Reference_point: "screening"
- Condition: "secondary ITP"
- Observation: "family history for ITP"
- Parsing_Error: "Positive"
- Condition: "autoimmune disease"
- Parsing_Error: "Presence or history"
- Subjective_judgement: "as judged by the investigator"
- Condition: "Hepatosplenomegaly"
- Subjective_judgement: "as judged by the investigator"
- Condition: "hepatic disease"
- Qualifier: "relevant"
- Parsing_Error: "Presence or history"
- Subjective_judgement: "as judged by the investigator"
- Parsing_Error: "Presence or history"
- Condition: "thromboembolic disease"
- Procedure: "splenectomy"
- Pregnancy_considerations: "Women who are pregnant or breast feeding"
- Pregnancy_considerations: "Intention to become pregnant during the course of the study"
- Pregnancy_considerations: "Lack of safe double contraception (see 7.1)"
- Procedure: "vaccination"
- Temporal: "2 weeks prior start of the study"
- Reference_point: "start of the study"
- Subjective_judgement: "Drugs with a known impact on the immune system or on platelet function must be recorded and an exclusion of the study should be discussed with the study center"
- Condition: "alcohol abuse"
- Condition: "drug abuse"
- Qualifier: "non-compliance"
- Post-eligibility: "Inability to follow the procedures of the study, e.g. due to language problems, psychological disorders, dementia of the study subject"
- Non-query-able: "Participation in another study with investigational drug within the 30 days preceding and during the present study"
- Non-query-able: "Previous enrolment into the current study"
- Drug: "romiplostim"
- Drug: "eltrombopag"
- Condition: "Hypersensitivity"
- Non-query-able: "to the active substance or to any of the excipients or to E. coli derived proteins"
- Non-query-able: "Enrolment of the investigator, his/her family members, employees and other dependent persons"